下列何者不是表面蛋白（apoproteins）的功能？
A. 與脂蛋白接受器結合
B. 輔助其他酵素
C. 是合成脂蛋白分解酵素（lipoprotein lipase）的前身（precursor）
D. 穩定脂蛋白之結構

正確答案：C. 是合成脂蛋白分解酵素（lipoprotein lipase）的前身（precursor）